Clinical trial inclusion criterion:
Patient is currently enrolled in a Novartis-sponsored, Oncology Clinical Development & Medical Affairs study receiving nilotinib and has fulfilled all their requirements in the parent study

Entity relations:
- Has_qualifier("enrolled in a Oncology Clinical Development & Medical Affairs study", "Novartis-sponsored")
- Has_temporal("enrolled in a Oncology Clinical Development & Medical Affairs study", "currently")